Clinical trial exclusion criterion:
Hemoglobin <9 g/dL

Entity relations:
- Has_value("Hemoglobin", "<9 g/dL")